women who are pregnant, lactating, or planning on becoming pregnant

The above is a clinical trial exclusion criterion. Annotated with entity spans:
[Person: women] who are [Condition: pregnant], [Condition: lactating], or [Mood: planning on becoming] [Condition: pregnant]